Clinical trial inclusion criterion:
Adult males and females who are 18 years of age or older.

Annotated entities:
- Person: "Adult"
- Person: "males"
- Person: "females"
- Value: "18 years of age or older"